Clinical trial exclusion criterion:
age under 18y or over 85y

Entity relations:
- Has_value("age", "under 18y or over 85y")